下列關於 Streptococcus pneumoniae 的敘述，何者錯誤？
A. 是引發肺炎的致病菌，不會在正常人咽喉中找到
B. 是革蘭氏陽性菌，且常呈雙球菌形態
C. 會產生莢膜，且為重要致病因子
D. 常造成肺部下方感染，又稱 lobar pneumonia

正確答案：A. 是引發肺炎的致病菌，不會在正常人咽喉中找到